承 15 題，若使用的鎮痛劑為前列腺素合成抑制劑類藥物，常有何種腸胃副作用？
A. 抑制胃黏液（mucus）分泌
B. 抑制胃蛋白酶（pepsin）分泌
C. 抑制胃酸（gastric acid）分泌
D. 抑制 H+/K+ ATPase 活性

正確答案：A. 抑制胃黏液（mucus）分泌